Clinical trial exclusion criterion:
A history of intravitreal anti-VEGF injection of any type in the study eye within the last 45 days prior to study enrollment.

Annotated entities:
- Temporal: "history of"
- Qualifier: "intravitreal"
- Procedure: "anti-VEGF injection"
- Qualifier: "in the study eye"
- Temporal: "within the last 45 days prior to study enrollment"
- Reference_point: "study enrollment"